Clinical trial exclusion criterion:
Cardiopulmonary instability (including pulmonary edema, cardiac insufficiency, myocardial infarction, acidosis and hemodynamic instability requiring significant vasopressor support)

Entity relations:
- Has_qualifier("vasopressor support", "significant")
- Has_qualifier("hemodynamic instability", "vasopressor support")
- Subsumes("Cardiopulmonary instability", "pulmonary edema")
- Subsumes("Cardiopulmonary instability", "vasopressor")
- OR("pulmonary edema", "hemodynamic instability", "myocardial infarction", "cardiac insufficiency", "acidosis")